Clinical trial exclusion criterion:
Patients receiving drugs affecting immune system like immunosuppressive drugs.

Annotated entities:
- Drug: "drugs affecting immune system"
- Drug: "immunosuppressive drugs"